Fusarium oxysporum f. sp lycopersici. is a plant pathogen in plants producing what common food?

Fusarium oxysporum f. sp lycopersici.produces causes vascular wilt disease in tomatoes.